Clinical trial inclusion criterion:
1. Male and female recipients of all races, ≥18 years of age.

Annotated entities:
- Person: "Male"
- Person: "female"
- Value: "≥18 years"
- Person: "age"